informed consent

The above is a clinical trial inclusion criterion. Annotated with entity spans:
i[Informed_consent: nformed consent]